Which is the most common monogenic cause of common variable immunodeficiency (CVID) in Europeans?

Loss-of-function nuclear factor kB subunit 1 (NFKB1) variants are the most common monogenic cause of common variable immunodeficiency in Europeans.